Clinical trial inclusion criterion:
History of preterm labor and/or midtrimester miscarriage in a previous pregnancy.

Annotated entities:
- Condition: "preterm labor"
- Condition: "midtrimester miscarriage"
- Temporal: "previous"
- Condition: "pregnancy"